RAS-MAPK訊息傳遞路徑同時可調控細胞死亡與存活的訊號，RAS的活化需要下列那一個分子？
A. ATP
B. GTP
C. NADH
D. Ca2+

正確答案：B. GTP